下列那一個構造不是triangle of Calot的邊界？
A. 右肝下緣
B. 總肝管（common hepatic duct）
C. 膽囊管（cystic duct）
D. 右門靜脈（right portal vein）

正確答案：D. 右門靜脈（right portal vein）